What is the function of a DEAD box protein?

DEAD-box helicases are ubiquitous in RNA-mediated processes and function by coupling cycles of ATP binding and hydrolysis to changes in affinity for single-stranded RNA.